有關腦死判定（brain death），下列何者不是臨床要件（clinical criteria）？
A. 患者需處於深度昏迷（deep coma），且對語言（verbal stimulation）及疼痛（pain stimulation）刺激無反應
B. 患者有自發性呼吸（spontaneous respiration）
C. 患者喪失腦幹反射（brain stem reflex）
D. 患者無自主性活動（spontaneous movement）或自主性姿態（spontaneous posturing）

正確答案：B. 患者有自發性呼吸（spontaneous respiration）